孕婦何時感染 rubella virus 最容易造成先天性胎兒畸形？
A. 懷孕初期三個月
B. 懷孕中期三個月
C. 懷孕後期三個月
D. 周產期

正確答案：A. 懷孕初期三個月